Blasts < 1,000/µL in PB on day 8

The above is a clinical trial inclusion criterion. Annotated with entity spans:
[Line: Blasts < 1,000/µL in PB on day 8]